Clinical trial exclusion criterion:
Pregnant or nursing women, or females with a positive pregnancy test at screening

Annotated entities:
- Condition: "Pregnant"
- Condition: "nursing"
- Person: "women"
- Person: "females"
- Value: "positive"
- Measurement: "pregnancy test"
- Temporal: "at screening"
- Reference_point: "screening"